25. Body Mass Index (BMI) > 30 kg/m²

The above is a clinical trial exclusion criterion. Annotated with entity spans:
[Parsing_Error: 25.] [Measurement: Body Mass Index (BMI)] [Value: > 30 kg/m²]